Clinical trial inclusion criteria:
healthy parturients with uncomplicated, single gestation pregnancies, full term (38-42 weeks of gestation) pregnancy, agreed to participate

Annotated entities:
- Condition: "healthy"
- Person: "parturients"
- Qualifier: "uncomplicated"
- Qualifier: "single gestation"
- Condition: "pregnancies"
- Qualifier: "full term"
- Condition: "pregnancy"
- Value: "38-42"
- Measurement: "weeks of gestation"
- Informed_consent: "agreed to participate"